Life expectancy of > 3 months

The above is a clinical trial inclusion criterion. Annotated with entity spans:
[Observation: Life expectancy] of [Value: > 3 months]